Clinical trial exclusion criterion:
Anaphylactic reaction to a previous dose of TIV(trivalent influenza vaccine)

Annotated entities:
- Condition: "Anaphylactic reaction"
- Drug: "trivalent influenza vaccine"
- Drug: "TIV"